Patients with occult or prior HBV infection (defined as positive total hepatitis B core antibody [HBcAb] and negative HBsAg) may be included if HBV DNA is undetectable. These patients must be willing to undergo monthly DNA testing.

The above is a clinical trial exclusion criterion. Annotated with entity spans:
Patients with occult or prior [Condition: HBV infection] (defined as [Value: positive] [Measurement: total hepatitis B core antibody [HBcAb]] and [Value: negative] [Measurement: HBsAg]) [Grammar_Error: may be included] if [Measurement: HBV DNA] is [Value: undetectable]. [Non-query-able: These patients must be willing to undergo monthly DNA testing.]